Participants' must have signed an informed consent document indicating that they understand the purpose of and procedures required for the study and are willing to participate in the study

The above is a clinical trial inclusion criterion. Annotated with entity spans:
[Post-eligibility: Participants' must have signed an informed consent document indicating that they understand the purpose of and procedures required for the study and are willing to participate in the study]